Patients who have previous prostate surgery Patients who have muscle invasive bladder cancer

The above is a clinical trial exclusion criterion. Annotated with entity spans:
[Line: Patients who have previous prostate surgery] [Line: Patients who have muscle invasive bladder cancer]